下列對於副黏液病毒科（Paramyxoviridae）之敘述，何者正確？
A. 為正股（positive sense）RNA病毒
B. 依核蛋白（nucleoprotein）共分為A、B及C三型
C. 核蛋白衣（nucleocapsid）為二十面體對稱結構
D. 皆具有	膜（envelope）及融合（fusion）蛋白質

正確答案：D. 皆具有	膜（envelope）及融合（fusion）蛋白質